¿Cuáles fueron los primeros autores que investigaron el papel que los eventos vitales estresantes podían tener sobre la salud?:
1. Mechanic.
2. Matarazzo.
3. Zola.
4. Lazarus.
5. Holmes y Rahe.

Respuesta correcta: 5. Holmes y Rahe.